Sever forms of peripheral arterial occlusive disease and Raynaud's syndrome.

The above is a clinical trial exclusion criterion. Annotated with entity spans:
[Qualifier: Sever] forms of [Condition: peripheral arterial occlusive disease] [Non-query-able: and] [Condition: Raynaud's syndrome].